The diagnosis of chronic bronchitis

The above is a clinical trial inclusion criterion. Annotated with entity spans:
The diagnosis of [Condition: chronic bronchitis]